La reacción de un alqueno con ácido metacloroperbenzoico origina un éter cíclico que se denomina:
1. Furano.
2. Dioxano.
3. Epóxido.
4. Azirano.
5. Lactona.

Respuesta correcta: 3. Epóxido.